Forced expiratory volume (FEV1)< 30% predicted

The above is a clinical trial inclusion criterion. Annotated with entity spans:
[Measurement: Forced expiratory volume] ([Measurement: FEV1])[Value: < 30% predicted]